Clinical trial exclusion criterion:
MI within 6 mo and LVEF < 45%

Annotated entities:
- Condition: "MI"
- Temporal: "within 6 mo"
- Measurement: "LVEF"
- Value: "< 45%"